Clinical trial exclusion criterion:
Platelet count < 75,000/ml

Annotated entities:
- Measurement: "Platelet count"
- Value: "< 75,000/ml"